Clinical trial exclusion criterion:
Secondary knee osteoarthritis

Annotated entities:
- Qualifier: "Secondary"
- Condition: "knee osteoarthritis"